What is the use of Atogepant?

Atogepant is used for preventive treatment of migraine.